Previous history of receiving the rabies vaccine.

The above is a clinical trial exclusion criterion. Annotated with entity spans:
[Temporal: Previous history] of receiving the [Drug: rabies vaccine].